Which genes does thyroid hormone receptor beta1 regulate in the heart?

β-MHC, HCN4, KCND2/3, SERCA, TRbeta1, alpha-MHC